Clinical trial inclusion criterion:
Known allergy to tested drugs

Annotated entities:
- Condition: "allergy"
- Drug: "tested drugs"